Hombre de 71 años de edad que presenta analítica con pancitopenia severa sin presencia de células inmaduras y con estudio medular sugestivo de anemia aplásica grave. ¿Cuál sería el abordaje terapéutico fundamental?
1. Tratamiento con metilprednisolona a dosis de 1 g/Kg/día durante 5 días.
2. Estudio de hermanos y si alguno es HLA compatible, transplante alogénico de progenitores hemopoyéticos.
3. Terapia inmunosupresora con ciclosporina e inmunoglobulina antitimocítica.
4. Soporte hemoterápico.
5. Quimioterapia y si respuesta trasplante autólogo de progenitores hemopoyéticos.

Respuesta correcta: 3. Terapia inmunosupresora con ciclosporina e inmunoglobulina antitimocítica.